Clinical trial exclusion criterion:
Presence of a serious medical illness including cardiac, hepatic, renal, respiratory, endocrinologic, neurologic, or hematologic disease or physical disorder judged to significantly affect central nervous system function

Annotated entities:
- Qualifier: "serious"
- Condition: "medical illness"
- Condition: "cardiac"
- Condition: "hepatic"
- Condition: "renal"
- Condition: "respiratory"
- Condition: "endocrinologic"
- Condition: "neurologic"
- Condition: "hematologic disease"
- Condition: "physical disorder"
- Non-query-able: "Presence of a serious medical illness including cardiac, hepatic, renal, respiratory, endocrinologic, neurologic, or hematologic disease or physical disorder judged to significantly affect central nervous system function"